Clinical trial inclusion criterion:
Life expectancy > 3 months.

Annotated entities:
- Observation: "Life expectancy"
- Value: "> 3 months"